一位 3 歲男孩，出生時因難產而有腦缺氧現象，3 個月大時被診斷罹患嬰兒點頭痙攣症（infantile spasm），現在除了點頭痙攣仍然存在外，還常有突然全身無力倒地、莫名其妙發呆及全身性僵直陣攣抽搐併神智喪失等現象。下列敘述何者錯誤？
A. 最可能的診斷為 Lennox-Gastaut syndrome
B. valproic acid 是常用於治療此症的藥物
C. 智能發展遲緩（mental retardation）為其診斷條件之一
D. 80%的病人在青春期後會逐漸康復而自動痊癒

正確答案：D. 80%的病人在青春期後會逐漸康復而自動痊癒